Patient less than age 4 years

The above is a clinical trial exclusion criterion. Annotated with entity spans:
Patient [Value: less than] [Person: age] 4 years